Doubtful compliance or unable to afford full course of therapy

The above is a clinical trial exclusion criterion. Annotated with entity spans:
[Observation: Doubtful compliance] or [Observation: unable to afford full course of therapy]